一位 58 歲男性突然出現嘔吐、大量水性腹瀉、急性腎衰竭等症狀，隨後在其糞便中分離出霍亂弧菌 （Vibrio cholerae）。下列何者最能做為確定此人罹患霍亂症（cholera）的依據？
A. 臨床症狀
B. 所分離的細菌能分泌霍亂毒素
C. 所分離的細菌屬 O1 血清型
D. 在病人的血清中偵測到霍亂毒素

正確答案：B. 所分離的細菌能分泌霍亂毒素